Liver cirrhosis

The above is a clinical trial inclusion criterion. Annotated with entity spans:
[Condition: Liver cirrhosis]